Epinephrine 作用在腎臟 juxtaglomerular apparatus 的何種 receptor 而導致 renin 的釋放增加？
A. α1
B. β1
C. α2
D. β2

正確答案：B. β1